A history of bleeding tendency;

The above is a clinical trial exclusion criterion. Annotated with entity spans:
A [Temporal: history] of [Condition: bleeding tendency];